Clinical trial exclusion criteria:
Contraindication to antiplatelet therapy
Need to continue clopidogrel due to stroke, peripheral disease, significant carotid disease or recent acute coronary syndrome
Major bleeding history or bleeding diathesis
Pregnancy

Annotated entities:
- Condition: "Contraindication"
- Drug: "antiplatelet therapy"
- Multiplier: "continue"
- Drug: "clopidogrel"
- Condition: "stroke"
- Condition: "peripheral disease"
- Qualifier: "significant"
- Condition: "carotid disease"
- Temporal: "recent"
- Condition: "acute coronary syndrome"
- Mood: "Need to"
- Qualifier: "Major"
- Temporal: "history"
- Condition: "bleeding"
- Condition: "bleeding diathesis"
- Condition: "Pregnancy"